Clinical trial inclusion criterion:
Adequate liver function (serum total bilirubin < 2 times the upper normal limit (UNL); serum transaminases levels <3 times [<5 times for patients with liver metastasis] UNL)

Entity relations:
- Has_value("liver function", "Adequate")
- Has_value("serum total bilirubin", "< 2 times the upper normal limit (UNL)")
- Has_value("serum transaminases levels", "<3 times UNL")
- AND("serum total bilirubin", "serum transaminases levels")
- Subsumes("Adequate", "serum total bilirubin")
- Has_value("liver metastasis", "<5 times UNL")
- OR("<3 times UNL", "liver metastasis")